Clinical trial exclusion criteria:
Pregnant women and nursing mothers are ineligible due to the possible risk of adverse effects in the newborn. Eligible patients of reproductive potential should use adequate contraception if sexually active.
Serious concurrent medical illness which would jeopardize the ability of the subject to receive the therapy as outlined in this protocol with reasonable safety.
Malignancy diagnosed or treated within 5 years (recent localized treatment of squamous or non-invasive basal cell skin cancers is permitted; cervical carcinoma in situ is allowed if appropriately treated prior to screening); subjects under evaluation for a malignancy are not eligible.
Infection with hepatitis B virus (HBV) or human immunodeficiency virus (HIV)
Use of any prohibited concomitant medications within 30 days of the Baseline/Day 1 visit.
Known hypersensitivity to LDV/SOF

Annotated entities:
- Pregnancy_considerations: "Pregnant women and nursing mothers are ineligible due to the possible risk of adverse effects in the newborn. Eligible patients of reproductive potential should use adequate contraception if sexually active."
- Post-eligibility: "Serious concurrent medical illness which would jeopardize the ability of the subject to receive the therapy as outlined in this protocol with reasonable safety."
- Condition: "Malignancy"
- Temporal: "within 5 years"
- Procedure: "treatment"
- Qualifier: "localized"
- Temporal: "recent"
- Condition: "squamous cell skin cancer"
- Condition: "non-invasive basal cell skin cancer"
- Negation: "permitted"
- Condition: "cervical carcinoma in situ"
- Negation: "allowed"
- Procedure: "treated"
- Qualifier: "appropriately"
- Temporal: "prior to screening"
- Non-representable: "subjects under evaluation for a malignancy are not eligible."
- Condition: "hepatitis B virus (HBV)"
- Condition: "human immunodeficiency virus (HIV)"
- Post-eligibility: "Use of any prohibited concomitant medications within 30 days of the Baseline/Day 1 visit."
- Condition: "hypersensitivity"
- Drug: "LDV"
- Drug: "SOF"